Clinical trial exclusion criterion:
Any confirmed or suspected immunosuppressive or immunodeficiency condition based on medical history and physical examination

Entity relations:
- Has_qualifier("immunosuppressive condition", "confirmed")
- Has_temporal("immunosuppressive condition", "medical history")
- OR("immunosuppressive condition", "immunodeficiency condition")
- OR("medical history", "physical examination")
- OR("confirmed", "suspected")